Las fases de la relación enfermera-paciente son las siguientes: Fase de Orientación, Fase de Identificación, Fase de Aprovechamiento y Fase de Resolución. Estas fases o etapas forman parte de:
1. Teoría de las Transiciones.
2. Filosofía y Teoría del Cuidado Transpersonal.
3. Modelo de Relaciones Interpersonales.
4. Filosofía de la Asistencia.

Respuesta correcta: 3. Modelo de Relaciones Interpersonales.